Clinical trial exclusion criteria:
Ongoing treatment with inotropic drugs (not norepinephrine)
Central venous oxygen saturation (ScvO2) < 60% despite optimization of hematocrit and volume status
Need of renal replacement therapy
Ongoing bleeding
Patient or next of kin does not consent with study participation

Annotated entities:
- Temporal: "Ongoing"
- Procedure: "treatment"
- Drug: "inotropic drugs"
- Drug: "norepinephrine"
- Negation: "not"
- Measurement: "Central venous oxygen saturation (ScvO2)"
- Value: "< 60%"
- Procedure: "optimization of hematocrit"
- Observation: "volume status"
- Observation: "despite"
- Procedure: "renal replacement therapy"
- Mood: "Need"
- Temporal: "Ongoing"
- Condition: "bleeding"
- Informed_consent: "Patient or next of kin does not consent with study participation"